Clinical trial inclusion criterion:
Adult patients (= 18 years)

Entity relations:
- Has_value("years", "= 18")